Cervical and vaginal infection.

The above is a clinical trial exclusion criterion. Annotated with entity spans:
[Condition: Cervical] and [Condition: vaginal infection].